Clinical trial exclusion criterion:
Patients with hyperkalemia (over 5.5 meq / L)

Entity relations:
- Has_value("hyperkalemia", "over 5.5 meq / L")